下列有關智能障礙之敘述，何者錯誤？
A. 智能障礙指的是智商低於 70
B. 智能障礙最常見的是中度智能不足
C. 約 2/3 的智能障礙可找出可能成因
D. fragile X syndrome 是智能障礙常見的成因之一

正確答案：B. 智能障礙最常見的是中度智能不足